欲研究某藥影響血壓在男女性別上是否有不同的效果。試驗結束後，求得男女二組平均血壓差的 95% 信賴區間（95% confidence interval）為（-0.82～2.72），則假設檢定（hypothesis testing）的結論是：
A. 拒絕對立假設（alternative hypothesis），表示男女藥效不同
B. 拒絕虛無假設（null hypothesis），表示男女藥效不同
C. 無法拒絕對立假設，表示男女藥效並無不同
D. 無法拒絕虛無假設，表示男女藥效並無不同

正確答案：D. 無法拒絕虛無假設，表示男女藥效並無不同